下列那一個菌種的 viridans streptococci 對 penicillin 具有較高的抵抗力？
A. Streptococcus mutans
B. Streptococcus mitis
C. Streptococcus salivarius
D. Streptococcus anginosus

正確答案：B. Streptococcus mitis